Clinical trial inclusion criterion:
Age = 18 years

Annotated entities:
- Person: "Age"
- Value: "= 18 years"